下列何者不屬於妊娠前糖尿病之新生兒合併症？
A. Respiratory distress
B. Hypoglycemia
C. Hypercalcemia
D. Hyperbilirubinemia

正確答案：C. Hypercalcemia